Clinical trial exclusion criterion:
evident intra-abdominal inflammation (diagnosed by imaging and/or laboratory results, including an abscess or cholecystitis)

Entity relations:
- AND("intra-abdominal inflammation", "imaging")
- Subsumes("intra-abdominal inflammation", "abscess")
- OR("abscess", "cholecystitis")
- OR("imaging", "laboratory")